Obesity (women with a body mass index >35 kg/m2 or men with a body mass index >42 kg/m2)

The above is a clinical trial exclusion criterion. Annotated with entity spans:
[Condition: Obesity] ([Person: women] with a [Measurement: body mass index] [Value: >35 kg/m2] or [Person: men] with a [Measurement: body mass index] [Value: >42 kg/m2])